Clinical trial exclusion criterion:
Patient on chemotherapy

Annotated entities:
- Procedure: "chemotherapy"